Clinical trial exclusion criteria:
Current pregnancy or lactation
Liver disease or elevated liver enzymes
Established diagnosis of diabetes mellitus
Abnormal serum glucose levels either at fasting or after the 2-hr oral glucose tolerance test meeting criteria for the diagnosis of diabetes mellitus according to the American Diabetes Association.
Insulin sensitizing treatment within 3 months prior to or during the eight week study period.
Hormonal treatment involving estrogen or progesterone 3 months prior to or during the study period, with the exception of medroxyprogesterone acetate for withdrawal bleeding.
Systemic or inhaled corticosteroids.
Known hypersensitive reaction to cinnamon.
Patients with seizure disorders, known cardiovascular disease, or cerebrovascular disease.
Body mass index (BMI)range 20-50 (excluding all women with BMI under 20 or over 50).

Annotated entities:
- Condition: "pregnancy"
- Condition: "lactation"
- Condition: "Liver disease"
- Condition: "elevated liver enzymes"
- Measurement: "liver enzymes"
- Value: "elevated"
- Condition: "diabetes mellitus"
- Value: "Abnormal"
- Measurement: "serum glucose levels"
- Condition: "Abnormal serum glucose levels"
- Temporal: "at fasting"
- Temporal: "after the 2-hr oral glucose tolerance test"
- Reference_point: "the 2-hr oral glucose tolerance test"
- Procedure: "2-hr oral glucose tolerance test"
- Reference_point: "fasting"
- Measurement: "criteria for the diagnosis of diabetes mellitus according to the American Diabetes Association"
- Value: "meeting"
- Qualifier: "meeting criteria for the diagnosis of diabetes mellitus according to the American Diabetes Association"
- Condition: "diabetes mellitus"
- Procedure: "Insulin sensitizing treatment"
- Temporal: "within 3 months prior to eight week study period"
- Temporal: "during the eight week study period"
- Drug: "estrogen"
- Drug: "progesterone"
- Temporal: "3 months prior to the study period"
- Temporal: "during the study period"
- Drug: "medroxyprogesterone acetate"
- Condition: "withdrawal bleeding"
- Negation: "exception"
- Drug: "inhaled corticosteroids"
- Drug: "Systemic corticosteroids"
- Qualifier: "Systemic"
- Qualifier: "inhaled"
- Condition: "hypersensitive reaction to cinnamon"
- Observation: "cinnamon"
- Condition: "seizure disorders"
- Condition: "cardiovascular disease"
- Condition: "cerebrovascular disease"
- Measurement: "Body mass index (BMI)"
- Value: "range 20-50"
- Parsing_Error: "(excluding all women with BMI under 20 or over 50)"